En relación a la intoxicación por agentes anticolinérgicos, señale la respuesta correcta.
1. En su tratamiento se utiliza la atropina.
2. La presencia de encefalopatía grados III o IV, insuficiencia renal aguda y coagulopatía grave indican el trasplante hepático.
3. El dantrolene está indicado en caso de convulsiones.
4. El tratamiento básico consiste en la administración repetida de carbón activado y medidas de soporte.
5. El descenso de la colinesterasa plasmática confirma el diagnóstico.

Respuesta correcta: 4. El tratamiento básico consiste en la administración repetida de carbón activado y medidas de soporte.